Clinical trial exclusion criterion:
Life-time history of dependence on cannabis or diagnosis of cannabis use disorder (CUD) according to the DSM 5

Entity relations:
- Has_qualifier("cannabis use disorder (CUD)", "DSM 5")
- OR("dependence on cannabis", "cannabis use disorder (CUD)")